Clinical trial exclusion criterion:
3. Cardiac pacemakers, neural stimulators, implantable defibrillator, implanted medication pumps, intracardiac lines, or acute, unstable cardiac disease, with intracranial implants (e.g. aneurysm clips, shunts, stimulators, cochlear implants, or electrodes) or any other metal object within or near the head that precludes MRI scanning.

Annotated entities:
- Parsing_Error: "3."
- Device: "Cardiac pacemakers"
- Device: "neural stimulators"
- Device: "implantable defibrillator"
- Device: "implanted medication pumps"
- Device: "intracardiac lines"
- Qualifier: "acute"
- Qualifier: "unstable"
- Condition: "cardiac disease"
- Device: "intracranial implants"
- Device: "aneurysm clips"
- Device: "shunts"
- Device: "stimulators"
- Device: "cochlear implants"
- Device: "electrodes"
- Device: "metal object within or near the head"
- Qualifier: "precludes MRI scanning"
- Negation: "precludes"
- Procedure: "MRI scanning"